為了瞭解不同物質是否有助於上皮細胞的生長而進行一項實	。在含有上皮細胞的細胞培養中，加入表皮細胞生長因子（epidermal growth factor）時，它會與細胞表面的受器（receptor）結合，導致RAS蛋白活化，造成轉錄因子（transcription factor）活化。上述實	對上皮細胞的作用，主要是經由下列何種細胞內的途徑進行？
A. Cyclic AMP
B. Cyclin-dependent kinases
C. JAK/STAT system
D. Mitogen-activated protein kinase

正確答案：D. Mitogen-activated protein kinase